Which gene is the paralog of yeast UPC2?

zinc cluster proteins Upc2 and Ecm22 promote filamentation